Clinical trial exclusion criterion:
Clinical diagnosis associated with increased risk of bleeding including known active peptic ulceration and/or neoplasm with increased bleeding risk

Entity relations:
- Has_qualifier("risk of bleeding", "increased")
- Has_qualifier("peptic ulceration", "active")
- Subsumes("risk of bleeding", "peptic ulceration")
- OR("peptic ulceration", "neoplasm")